Chronic pain or narcotic usage during the preceding 30 days

The above is a clinical trial exclusion criterion. Annotated with entity spans:
[Condition: Chronic pain] or [Drug: narcotic] usage [Temporal: during the preceding 30 days]